Scatchard分析法能提供下列何種資訊？
A. 酵素的功能放大（enzyme cascades）
B. 酵素的催化反應（catalytic reaction）過程
C. 蛋白質磷酸化（protein phosphorylation）
D. 受體與配體之交互作用（receptor-ligand interactions）

正確答案：D. 受體與配體之交互作用（receptor-ligand interactions）